下列何者與主動運輸（active transport）中，提供運輸過程的熱力學驅動力（thermodynamic driving force）無關？
A. 光能的補獲
B. 三磷酸腺苷（ATP）的水解作用
C. 大分子的合成
D. 離子梯度的消耗（depletion of ion gradient）

正確答案：C. 大分子的合成